Clinical trial inclusion criterion:
Age>18 years.

Entity relations:
- Has_value("Age", ">18 years.")